Clinical trial inclusion criterion:
Patients where antibiotic therapy has already been started (prior to randomization)

Entity relations:
- Has_index("prior to randomization", "randomization")
- Has_temporal("antibiotic therapy", "prior to randomization")